Routine blood test:WBC=3.0×109/L,Neutrophils=1.5×109/L,Hb=100g/L,Platelet=80×109/L; LVEF=50%;

The above is a clinical trial inclusion criterion. Annotated with entity spans:
Routine blood [Measurement: test:WBC][Value: =3.0×109/L],[Measurement: Neutrophils][Value: =1.5×109/L],[Measurement: Hb][Value: =100g/L],[Measurement: Platelet][Value: =80×109/L]; [Measurement: LVEF][Value: =50%];